La fiebre de Chikungunya es un una enfermedad aguda trasmitida por picadura de mosquito. Es endémica en ciertas áreas de África y Asia. En los últimos años se han reconocido casos en Europa y América. En relación con ella, conteste la respuesta CORRECTA:
1. El síntoma clínico característico, aparte de la fiebre, es la poliartralgia debilitante.
2. El origen geográfico probable de la enfermedad está en el sur de Asia.
3. El diagnóstico se realiza habitualmente durante la fase virémica mediante PCR.
4. La mortalidad es mayor en adolescentes y jóvenes.

Respuesta correcta: 1. El síntoma clínico característico, aparte de la fiebre, es la poliartralgia debilitante.